Clinical trial exclusion criterion:
Allergy or intolerance to aspirin or clopidogrel.

Annotated entities:
- Condition: "Allergy"
- Condition: "intolerance"
- Drug: "aspirin"
- Drug: "clopidogrel"